Clinical trial inclusion criterion:
temperature = 37<U+2103>

Annotated entities:
- Measurement: "temperature"
- Value: "= 37<U+2103>"